What causes yellowing of the skin and eyes, also known as jaundice, in patients with liver failure?

Jaundice refers to yellow coloration of the skin and the sclera (white of the eyes) of newborn babies that result from the accumulation of bilirubin in the skin and mucous membranes.